Lesch-Nyhan syndrome 是 因 缺 乏 次 黃 嘌 呤 － 鳥 嘌 呤 磷 酸 核 苷 轉 移 酶 （ hypoxanthine-guanine phosphoribosyltransferase），因而發生下列何種現象？
A. 大量嘌呤（purine）生合成
B. 大量 dTTP 合成
C. 在血液中 dCTP 量非常低
D. 尿液出現大量尿素（urea）

正確答案：A. 大量嘌呤（purine）生合成